Serum ferritin =500 ng/mL and transferrin saturation (TSAT) =25%

The above is a clinical trial inclusion criterion. Annotated with entity spans:
[Measurement: Serum ferritin] [Value: =500 ng/mL] and [Measurement: transferrin saturation] ([Measurement: TSAT]) [Value: =25%]